Clinical trial inclusion criterion:
Patient is receiving chronic oral anticoagulation therapy (i.e., vitamin K antagonist, direct thrombin inhibitor, Factor Xa inhibitor)

Entity relations:
- Has_multiplier("oral anticoagulation therapy", "chronic")
- Subsumes("oral anticoagulation therapy", "vitamin K antagonist")
- OR("vitamin K antagonist", "direct thrombin inhibitor", "Factor Xa inhibitor")